Clinical trial exclusion criterion:
known allergy to administered opioid

Entity relations:
- AND("allergy", "opioid")